Clinical trial exclusion criterion:
history of uveitis

Entity relations:
- Has_temporal("uveitis", "history")